Clinical trial inclusion criterion:
>7 Metabolic Equivalents

Annotated entities:
- Value: ">7"
- Measurement: "Metabolic Equivalents"